對於心臟衰竭之治療，以下何種藥物無法增加存活率？
A. 血管收縮素轉化酶抑制劑（angiotensin-converting enzyme inhibitor，ACEI）
B. 毛地黃（digoxin）
C. 乙型交感神經拮抗劑（β-blockers）
D. 醛固酮拮抗劑（spironolactone）

正確答案：B. 毛地黃（digoxin）